Clinical trial inclusion criterion:
Pretreatment with any CYP3A inducers or inhibitors

Entity relations:
- AND("Pretreatment", "CYP3A inducers")
- OR("CYP3A inducers", "CYP3A inhibitors")